下列有關毒殺性 T 細胞（cytotoxic T lymphocyte, CTL）與自然殺手細胞（natural killer cell, NK cell）之比較，何者錯誤？
A. 二者皆具有抗原特異性
B. 二者皆會表現 FasL
C. 二者的活性皆與 MHC class I 有關
D. 不表現 MHC class I 分子的腫瘤細胞，可以逃過 CTL 的辨認，但是無法逃過 NK cell 的追蹤

正確答案：A. 二者皆具有抗原特異性